Clinical trial inclusion criteria:
Asymptomatic women 45-68 years, residents in the Piedmont Region, attending the regional breast cancer screening program

Annotated entities:
- Qualifier: "Asymptomatic"
- Person: "women"
- Value: "45-68 years"
- Visit: "Piedmont Region"
- Procedure: "regional breast cancer screening program"